Clinical trial exclusion criterion:
3. Persistent pulmonary hypertension of the newborn

Annotated entities:
- Parsing_Error: "3."
- Condition: "pulmonary hypertension of the newborn"
- Qualifier: "Persistent"